Subject with any unstable medical, psychiatric, or substance abuse disorder that in the opinion of the investigator is likely to affect the subject's ability to complete the study or preclude the subject's participation in the study

The above is a clinical trial exclusion criterion. Annotated with entity spans:
Subject with any [Qualifier: unstable] [Condition: medical], [Condition: psychiatric], or [Condition: substance abuse disorder] that [Non-representable: in the opinion of the investigator] is [Qualifier: likely to affect the subject's ability to complete the study] or [Qualifier: preclude the subject's participation in the study]